6. Body weight exceeding 150 Kg

The above is a clinical trial exclusion criterion. Annotated with entity spans:
[Parsing_Error: 6.] [Measurement: Body weight] [Value: exceeding 150 Kg]